Clinical trial exclusion criterion:
Admission to the intensive care unit for current pulmonary exacerbation in the two weeks prior to Visit 2, unless admission was due to a desensitization protocol

Entity relations:
- multi("Admission to the intensive care unit", "intensive care unit")
- AND("Admission to the intensive care unit", "pulmonary exacerbation")
- Has_index("in the two weeks prior to Visit 2", "Visit 2")
- Subsumes("pulmonary exacerbation", "in the two weeks prior to Visit 2")
- Has_negation("desensitization protocol", "unless")